Clinical trial exclusion criterion:
1. patient refusal

Annotated entities:
- Non-query-able: "1. patient refusal"